Allergy to anesthetic agents

The above is a clinical trial exclusion criterion. Annotated with entity spans:
[Condition: Allergy] to [Drug: anesthetic agents]